Patients at potential increased risk of iatrogenic probiotic infection (see Section 2.6 for detailed explanation) including specific immunocompromised populations (HIV <200 CD4 cells/µL, those receiving chronic immunosuppressive medications (e.g., azathioprine, cyclosporine, cyclophosphamide, tacrolimus, methotrexate, mycofenolate, Anti-IL2), previous transplantation (including stem cell) at any time, malignancy requiring chemotherapy in the last 3 months, neutropenia [absolute neutrophil count < 500]). However, patients receiving corticosteroids previously or presently or projected to receive corticosteroids are not excluded;

The above is a clinical trial exclusion criterion. Annotated with entity spans:
Patients at potential increased [Observation: risk of iatrogenic probiotic infection] (see Section 2.6 for detailed explanation) including specific [Condition: immunocompromised] populations ([Condition: HIV] [Value: <200] [Measurement: CD4] cells/µL, those receiving [Qualifier: chronic] [Procedure: immunosuppressive medications] (e.g., [Drug: azathioprine], [Drug: cyclosporine], [Drug: cyclophosphamide], [Drug: tacrolimus], [Drug: methotrexate], [Drug: mycofenolate], [Drug: Anti-IL2]), previous [Procedure: transplantation] (including stem cell) at any time, malignancy requiring [Procedure: chemotherapy] in the [Temporal: last 3 months], [Condition: neutropenia] [[Measurement: absolute neutrophil count] [Value: < 500]]). However, patients receiving corticosteroids previously or presently or projected to receive corticosteroids are not excluded;